Use of any systemic estrogen, progestin, or DHEA in the eight weeks prior to randomization.

The above is a clinical trial exclusion criterion. Annotated with entity spans:
Use of any [Drug: systemic estrogen], progestin, or [Drug: DHEA] [Temporal: in the eight weeks prior to randomization].